Any intramuscular or intravenous corticosteroid injection within 2 weeks before baseline

The above is a clinical trial inclusion criterion. Annotated with entity spans:
Any [Qualifier: intramuscular] or [Qualifier: intravenous] [Procedure: corticosteroid injection] [Temporal: within 2 weeks before baseline]